Clinical trial exclusion criterion:
7. Subjects who have received an investigational drug within 30 days prior to the initial dose of study medication.

Annotated entities:
- Parsing_Error: "7."
- Non-query-able: "Subjects who have received an investigational drug within 30 days prior to the initial dose of study medication."